Clinical trial inclusion criterion:
Blood glucose levels between >140 mg and <400 mg/dL without laboratory evidence of diabetic ketoacidosis

Annotated entities:
- Measurement: "Blood glucose levels"
- Value: ">140 mg and <400 mg/dL"
- Negation: "without"
- Qualifier: "laboratory evidence"
- Condition: "diabetic ketoacidosis"